What is the role of SDE2?

SDE2 is required for ribosome biogenesis and the regulation of alternative splicing